Clinical trial exclusion criterion:
Pregnant women, breast-feeding

Annotated entities:
- Condition: "Pregnant"
- Person: "women"
- Condition: "breast-feeding"